uterine size >12 weeks.

The above is a clinical trial exclusion criterion. Annotated with entity spans:
[Measurement: uterine size] [Value: >12 weeks].